Hypertension diagnosis

The above is a clinical trial exclusion criterion. Annotated with entity spans:
[Condition: Hypertension] diagnosis